Moderate to severe COPD (post-bronchodilator forced expiratory volume in 1 s (FEV1) 30-79%predicted);

The above is a clinical trial inclusion criterion. Annotated with entity spans:
[Qualifier: Moderate to severe] [Condition: COPD] ([Qualifier: post-bronchodilator] [Measurement: forced expiratory volume in 1 s (FEV1)] [Value: 30-79%predicted]);